下列那一種胺基酸是血清素（serotonin）生合成的前驅物？
A. arginine
B. glutamic acid
C. tryptophan
D. tyrosine

正確答案：C. tryptophan